Clinical trial inclusion criterion:
HbA1c > 13.0 %

Entity relations:
- Has_value("HbA1c", "> 13.0 %")